Which CYP gene polymorphism is a well-known predictor of efavirenz disposition?

Cytochrome P450 (CYP) CYP2B6 G516T (rs3745274) is a well-known predictor of efavirenz disposition.